previous history of respiratory disease other than COPD

The above is a clinical trial exclusion criterion. Annotated with entity spans:
[Temporal: previous history] of [Condition: respiratory disease] [Negation: other than] [Condition: COPD]